Clinical trial inclusion criteria:
Patients with anaemia (males Hb <130 g/L, females <120 g/L) undergoing elective cardiac surgery, and available to receive trial drug 1- 10 weeks prior to surgery

Annotated entities:
- Condition: "anaemia"
- Person: "males"
- Measurement: "Hb"
- Value: "<130 g/L"
- Person: "females"
- Value: "<120 g/L"
- Qualifier: "elective"
- Procedure: "cardiac surgery"
- Mood: "available to receive"
- Drug: "trial drug"
- Temporal: "1- 10 weeks prior to surgery"
- Reference_point: "surgery"
- Procedure: "surgery"